Which receptor is blocked by Finerenone?

Finerenone is a nonsteroidal mineralocorticoid receptor antagonist.